What is OHRQoL?

Diseases and disorders that damage the mouth and face can disturb well-being and his self-esteem. Oral health-related quality of life (OHRQOL) is a relatively new but rapidly growing concept and can be assessed using a number of different methods including standardized questionnaires.  The OHRQoL is a concept that includes functional, social, emotional, and environmental issues. How patients perceive their oral health-related quality of life (OHRQoL) is important for health-care provider for understanding and planning in patient management.